Clinical trial exclusion criterion:
Patients having earned more than 4500€ in indemnities for participation in clinical trials during the previous 12 months, including this study.

Entity relations:
- Has_index("during the previous 12 months", "the previous 12 months")
- Has_temporal("participation in clinical trials", "during the previous 12 months")
- AND("earned more than 4500€ in indemnities", "earned more than 4500€ in indemnities")
- AND("earned more than 4500€ in indemnities", "participation in clinical trials")